Which gene is primarily associated with the Saethre-Chotzen syndrome?

Saethre-Chotzen syndrome (SCS) is a multiple congenital anomaly-mental retardation complex caused by mutations in the TWIST1 gene.